Clinical trial inclusion criterion:
Patients undergoing ambulatory hand surgery for carpal tunnel and trigger finger, under local anesthesia with or without sedation.

Annotated entities:
- Qualifier: "ambulatory"
- Procedure: "hand surgery"
- Condition: "carpal tunnel"
- Condition: "trigger finger"
- Procedure: "local anesthesia"